Clinical trial exclusion criterion:
Pregnant or breast feeding

Entity relations:
- OR("Pregnant", "breast feeding")